Clinical trial inclusion criteria:
15 weeks 0 days gestational age - 23 weeks 5 days gestational age at time of dilator insertion
Able to read and write in English
Active cell phone with text messaging capability
Ride home from dilator insertion clinic appointment

Annotated entities:
- Value: "15 weeks 0 days - 23 weeks 5 days"
- Measurement: "gestational age"
- Temporal: "at time of dilator insertion"
- Reference_point: "dilator insertion"
- Observation: "Able to read and write in English"
- Observation: "Active cell phone with text messaging capability"
- Observation: "Ride home"
- Procedure: "dilator insertion"